疱疹病毒感染常造成病毒在宿主體內建立潛伏性感染，其中水痘－帶狀疱疹病毒（VZV）造成幼童出現水痘以及成年人之帶狀疱疹，此病毒在下列何者建立潛伏性感染？
A. 皮膚
B. 肝臟
C. 神經細胞
D. 脾臟

正確答案：C. 神經細胞